Long-term use of NSAIDs

The above is a clinical trial exclusion criterion. Annotated with entity spans:
[Multiplier: Long-term use] of [Drug: NSAIDs]